超音波顯示胎兒頭部有 lemon sign，表示胎兒有何畸形？
A. 脊柱裂（spina bifida）
B. 小腦萎縮（cerebellum atrophy）
C. 水腦症（hydrocephalus）
D. 無腦症（anencephaly）

正確答案：A. 脊柱裂（spina bifida）